Clinical trial exclusion criterion:
anaphylaxis in the past six weeks,

Entity relations:
- Has_temporal("anaphylaxis", "in the past six weeks")